Clinical trial exclusion criterion:
Allergy to Pregnyl® or some of its ingredients in the medication or other contraindications due to Pregnyl®

Entity relations:
- AND("Pregnyl", "Allergy")
- AND("contraindications", "Pregnyl")
- OR("Pregnyl", "some of its ingredients")
- OR("Allergy", "contraindications")